La desfibrilación se caracteriza porque:
1. Requiere la sedación previa del paciente.
2. Se suele utilizar cuando el paciente está en asistolia.
3. Se puede aplicar en las taquicardias ventriculares con pulso.
4. La descarga no está sincronizada con el ritmo cardiaco del enfermo.
5. Se debe utilizar una descarga de mínima intensidad.

Respuesta correcta: 4. La descarga no está sincronizada con el ritmo cardiaco del enfermo.